Clinical trial exclusion criterion:
Known history of angioedema.

Entity relations:
- Has_temporal("angioedema", "history")